Clinical trial inclusion criterion:
Informed consent obtained prior to any screening procedure

Annotated entities:
- Post-eligibility: "Informed consent obtained prior to any screening procedure"